Contraindications for magnetic resonance imaging

The above is a clinical trial exclusion criterion. Annotated with entity spans:
[Condition: Contraindications] for [Procedure: magnetic resonance imaging]